Clinical trial exclusion criterion:
Has been diagnosed with Glucose-6-phosphate dehydrogenase deficiency or methemoglobin reductase deficiency

Entity relations:
- OR("Glucose-6-phosphate dehydrogenase deficiency", "methemoglobin reductase deficiency")